良性前列腺肥大手術的絕對適應症為何？
A. 每晚夜尿7次，嚴重影響生活品質
B. 急性尿滯留
C. 因膀胱出口阻塞造成的兩側腎水腫
D. 尿路感染

正確答案：C. 因膀胱出口阻塞造成的兩側腎水腫